肥胖婦女，血液中何者最可能下降？
A. Androgen
B. Insulin
C. Sex hormone binding globulin
D. Estrone

正確答案：C. Sex hormone binding globulin